Clinical trial inclusion criterion:
Willing to adhere to a specific treatment duration determined by initial response to treatment and subsequent randomization

Annotated entities:
- Mood: "Willing to"
- Non-representable: "adhere to a specific treatment duration determined by initial response to treatment and subsequent randomization"